Clinical trial exclusion criterion:
Severe hepatitis activity as documented by ALT>10 x ULN

Entity relations:
- Has_qualifier("hepatitis", "Severe")
- Has_value("ALT", ">10 x ULN")
- AND("hepatitis", "ALT")